Clinical trial exclusion criterion:
angioneurotic edema in medical history (hereditary / idiopathic or associated with prior treatment with ACE inhibitors)

Annotated entities:
- Condition: "angioneurotic edema"
- Qualifier: "idiopathic"
- Qualifier: "hereditary"
- Qualifier: "associated"
- Procedure: "treatment"
- Temporal: "prior"
- Drug: "ACE inhibitors"